Las reacciones de hipersensibilidad inmediata o alergia están mediadas por:
1. Autoanticuerpos.
2. Complejos antígeno-anticuerpo.
3. IgE.
4. Linfocitos Th1.
5. Linfocitos Th17.

Respuesta correcta: 3. IgE.